Clinical trial exclusion criterion:
Pregnant or breastfeeding

Entity relations:
- OR("Pregnant", "breastfeeding")